Clinical trial inclusion criterion:
Prostate volume > 100 cc

Annotated entities:
- Measurement: "Prostate volume"
- Value: "> 100 cc"